Clinical trial exclusion criterion:
Severely carious teeth resulting in inability to isolate for procedure

Annotated entities:
- Condition: "carious teeth"
- Qualifier: "Severely"
- Condition: "inability to isolate for procedure"